16. Known prior inability or unavailability to complete required study visits during study participation

The above is a clinical trial exclusion criterion. Annotated with entity spans:
[Parsing_Error: 16.] [Non-query-able: Known prior inability or unavailability to complete required study visits during study participation]